Clinical trial exclusion criterion:
history of systemic or ocular thromboembolic events.

Entity relations:
- Has_qualifier("thromboembolic events", "systemic")
- OR("systemic", "ocular")